What is Hikikomori syndrome?

Hikikomori syndrome is a Japanese culture-bound syndrome and a serious social withdrawal in Japan. It's a condition in which a subject locks himself/self into a house for a prolonged period of time for the period of 6 months or more, with no evident psychosis.